Clinical trial inclusion criterion:
No more than one HIV-1 plasma RNA greater than or equal to 50 and less than 200 copies/mL (only one "blip") in the past 6 months with a subsequent HIV-1 plasma RNA less than 50 copies/mL. NOTE: There should be no plasma HIV-1 RNA greater than 200 copies/mL within the 6 months prior to study entry.

Entity relations:
- Has_value("HIV-1 plasma RNA", "greater than or equal to 50 and less than 200 copies/mL")
- Has_multiplier("HIV-1 plasma RNA", "No more than one")
- Has_value("HIV-1 plasma RNA", "less than 50 copies/mL")
- Has_temporal("HIV-1 plasma RNA", "subsequent")
- Has_temporal("HIV-1 plasma RNA", "in the past 6 months")
- AND("HIV-1 plasma RNA", "HIV-1 plasma RNA")
- Has_value("plasma HIV-1 RNA", "greater than 200 copies/mL")
- Has_negation("plasma HIV-1 RNA", "no")